某疾病第一年的存活率為 0.5，第二年的存活率為 0.4，第三年的存活率為 0.3。請問此疾病三年的存活率為何？
A. 0.30
B. 0.20
C. 0.09
D. 0.06

正確答案：D. 0.06